At least six (6) weeks of failed, conservative treatment prior to surgery, or requires immediate surgery to prevent permanent disability.

The above is a clinical trial inclusion criterion. Annotated with entity spans:
[Multiplier: At least six (6) weeks] of [Qualifier: failed], [Qualifier: conservative] [Procedure: treatment] [Temporal: prior to surgery], or requires [Qualifier: immediate] [Procedure: surgery] to [Mood: prevent] [Condition: permanent disability].